一位 48 歲無業遊民，先前已知有肺結核，但未按時服藥。這週來因為輕微咳血而來急診，電腦斷層掃描發現只有右上肺支氣管擴張症，下列何種處置對此病患較理想？
A. 先給予有效抗結核藥物後，開刀切除有問題的肺葉
B. 給止血藥，然後繼續追蹤
C. 作支氣管血管攝影，作血管栓塞
D. 作胸壁整形充填術

正確答案：A. 先給予有效抗結核藥物後，開刀切除有問題的肺葉